Coagulopathies (with prothrombin concentration less than 60% or INR more than 1.5)

The above is a clinical trial exclusion criterion. Annotated with entity spans:
[Condition: Coagulopathies] (with [Measurement: prothrombin concentration] [Value: less than 60%] or [Measurement: INR] [Value: more than 1.5])